下列那一類抗生素是藉由干擾細菌 RNA 合成的機制，且可用來治療結核桿菌及痲瘋分枝桿菌的感染，但口服後尿液會呈橘紅色？
A. isoniazid
B. ethionamide
C. cycloserine
D. rifampin

正確答案：D. rifampin